Clinical trial inclusion criterion:
Rapid-antigen detection test (RADT) positive for GAS-

Entity relations:
- Subsumes("Rapid-antigen detection test", "RADT")
- Has_value("Rapid-antigen detection test", "positive")
- Has_qualifier("positive", "GAS-")